Clinical trial exclusion criterion:
History of medically treated diabetes or of treated or medically diagnosed hypertension. Heterozygous subjects who have diagnosed hypertension and are well controlled on treatment (Refer to Exclusion Criteria 20 below), are eligible. .

Entity relations:
- AND("medically treated", "medically treated")
- Has_qualifier("diabetes", "medically treated")
- Has_qualifier("hypertension", "treated")
- Has_temporal("diabetes", "History")
- Has_temporal("hypertension", "History")
- Has_qualifier("hypertension", "well controlled")
- AND("Heterozygous", "hypertension")
- AND("well controlled", "treatment")
- OR("medically", "medically treated")
- OR("treated", "medically")
- OR("diabetes", "hypertension")